En la técnica ICP-MS, las interferencias isobáricas:
1. Se dan cuando dos elementos comparten algún isotopo con la misma masa/carga nominal.
2. En ICP-MS no se dan este tipo de interferencias debido a la fuente de ionización energética que es el ICP.
3. Se deben a especies moleculares compuestas por dos o más átomos cuya relación masa/carga coincide con la nominal del isotopo del elemento de interés.
4. Se deben a especies cuya doble carga hace que su relación masa/carga coincida con la nominal del analito de interés.

Respuesta correcta: 1. Se dan cuando dos elementos comparten algún isotopo con la misma masa/carga nominal.